Epstein-Barr 病毒（EBV）感染人體後和免疫系統相互作用會引起各式各樣的疾病。下列何者不屬於 EBV 感染後引起的疾病表現？
A. 感染性單核球增多症
B. 急性 B 細胞淋巴球性白血病
C. 鼻咽癌
D. 產生多株自體抗體

正確答案：B. 急性 B 細胞淋巴球性白血病